Presence of acute suicidality

The above is a clinical trial exclusion criterion. Annotated with entity spans:
Presence of [Condition: acute suicidality]